鄰近小腦天幕（cerebellar tentorium）之大腦皮質所需的血液主要是由何動脈供應？
A. 腦膜中動脈（middle meningeal artery）
B. 大腦前動脈（anterior cerebral artery）
C. 小腦上動脈（superior cerebellar artery）
D. 大腦後動脈（posterior cerebral artery）

正確答案：D. 大腦後動脈（posterior cerebral artery）